Clinical trial exclusion criterion:
Exclusion criteria controls: First degree relatives with psychiatric disease, Substance abuse during the last 3 month or positive screening of drugs in urine-sample, Head injury with more than 5 minutes of unconsciousness, Components of metal implanted by operation, Pacemaker, Pregnancy, Severe physical illness

Entity relations:
- Has_context("psychiatric disease", "First degree relatives")
- Has_temporal("Substance abuse", "during the last 3 month")
- Has_qualifier("screening of drugs", "urine-sample")
- Has_value("screening of drugs", "positive")
- Has_multiplier("unconsciousness", "more than 5 minutes")
- AND("Head injury", "unconsciousness")
- AND("controls", "psychiatric disease")
- OR("psychiatric disease", "Severe physical illness", "Pacemaker", "Components of metal", "Head injury", "screening of drugs", "Substance abuse", "Pregnancy")